Clinical trial exclusion criterion:
Current use of other GLP-1A, dipeptidyl peptidase 4 (DPP4) or Sodium Glucose transporters 2 (SGLT2) inhibitors, thiazolidinediones (TZDs), pramlintide and fixed prandial insulin.

Annotated entities:
- Drug: "GLP-1A"
- Qualifier: "other"
- Drug: "dipeptidyl peptidase 4 (DPP4) inhibitors"
- Drug: "Sodium Glucose transporters 2 (SGLT2) inhibitors"
- Drug: "thiazolidinediones (TZDs)"
- Drug: "pramlintide"
- Drug: "prandial insulin"